Use of any prescription or over-the-counter medication, herbal medication, vitamins, or mineral supplements within 14 days prior to study drug administration (not including paracetamol). Medication for chronic use in age related disease will be allowed after approval by both the investigator and to the sponsor. No change in dose or regimen will be permitted during the study that is, from the Screening visit until the follow-up visit

The above is a clinical trial exclusion criterion. Annotated with entity spans:
Use of [Drug: any prescription] or [Drug: over-the-counter medication], [Drug: herbal medication], [Drug: vitamins], or [Drug: mineral supplements] [Temporal: within 14 days prior to study drug administration] ([Negation: not] including [Drug: paracetamol]). [Drug: Medication] for [Multiplier: chronic use] in [Condition: age related disease] [Grammar_Error: will be allowed] after [Subjective_judgement: approval by both the investigator and to the sponsor]. [Not_a_criteria: No change in dose or regimen will be permitted during the study that is, from the Screening visit until the follow-up visit]